What type of cancers and inherited diseases have been associated to mutations in the Notch pathway?

So far, mutations in Notch and other components of its signaling pathway have been implicated in an array of human diseases (T-cell leukemia and other cancers,  Multiple Sclerosis,  CADASIL,  Alagille Syndrome,  Spondylocostal Dysostosis), but more pathologies are likely to be associated with Notch in the future due to its network complexity.